今年 29 歲的陳小姐，來門診希望減肥，她的身高 156 公分，體重 62.27 公斤，BMI 25.59，陳小姐的母親有糖尿病；下列那一項資料對評估她的健康狀況最有幫助？
A. 皮摺厚度（skin-fold thickness）
B. 腰圍
C. 臀圍
D. 陳小姐母親的 BMI

正確答案：B. 腰圍